Concurrent participation in another clinical trial

The above is a clinical trial exclusion criterion. Annotated with entity spans:
Concurrent [Observation: participation in another clinical trial]